Clinical trial exclusion criterion:
14. Serum potassium<3.2mmol/L, or>5.5mmol/L;

Annotated entities:
- Measurement: "Serum potassium"
- Value: "<3.2mmol/L"
- Value: ">5.5mmol/L"